動脈瘤形成的危險因素不包括下列何者？
A. 高年齡
B. 男性
C. 高血脂
D. 糖尿病

正確答案：D. 糖尿病